一位70歲男性病人因右側肋膜積液（pleural effusion）掛胸腔科門診，經胸腔超音波檢查並做肋膜積液抽吸送檢，肋膜積液分析發現白血球1280/mm3，neutrophil/lymphocyte ratio： 8/92，蛋白質（protein）數值為3.8 g/dL，血清蛋白質為5.2 g/dL，細胞學檢查無惡性細胞， adenosine deaminase（ADA）為70 IU/L，在臺灣最可能的診斷是：
A. 惡性肋膜積液
B. 結核性肋膜積液
C. 肺炎併發肋膜積液
D. 膿胸

正確答案：B. 結核性肋膜積液